新生男嬰，呈現肌張力不足（hypotonia）、餵食困難，膚色較白且有雙側隱睪，手掌、腳掌都比較小，造成他異常最可能的原因是：
A. 染色體之微缺失（microdeletion）
B. 染色體複製時易位（translocation）
C. 性染色體異常
D. 生產傷害

正確答案：A. 染色體之微缺失（microdeletion）